Lo que caracteriza a la llamada “Cultura del Honor” es respaldar que una de las formas de solucionar las amenazas contra la reputación social sea:
1. El proceso judicial.
2. La mediación.
3. La violencia.
4. La negociación.
5. La coexistencia pacífica.

Respuesta correcta: 3. La violencia.